History of spinal cord stenosis or clinical symptoms of lumbar radiculopathy;

The above is a clinical trial exclusion criterion. Annotated with entity spans:
[Temporal: History] of [Condition: spinal cord stenosis] or [Condition: clinical symptoms] of [Condition: lumbar radiculopathy];